Clinical trial exclusion criterion:
A serious, unstable illness, as judged by the Investigator, during the past 3 months before screening/baseline visit including but not limited to: hepatic, renal, gastro-enterologic, respiratory, cardiovascular, endocrinologic, neurologic or immunologic disease;

Entity relations:
- Has_qualifier("unstable illness", "serious")
- Has_qualifier("serious", "as judged by the Investigator")
- Has_temporal("unstable illness", "during the past 3 months before screening/baseline visit")
- Subsumes("unstable illness", "hepatic disease")
- OR("hepatic disease", "neurologic disease", "endocrinologic disease", "renal disease", "cardiovascular disease", "gastro-enterologic disease", "immunologic disease", "respiratory disease")